Clinical trial inclusion criterion:
Ages =18 years old, < 80 years old;

Entity relations:
- Has_value("Ages", "=18 years old, < 80 years old")